Clinical trial exclusion criterion:
Advanced heart block or sinus node dysfunction

Annotated entities:
- Condition: "sinus node dysfunction"
- Condition: "heart block"
- Qualifier: "Advanced"